Women who are in their first 5 years of menopause

The above is a clinical trial inclusion criterion. Annotated with entity spans:
[Person: Women] who are i[Temporal: n their first 5 years of menopause]